32歲G1P0孕婦，妊娠29週被診斷為子癇前症（preeclampsia），現妊娠35週主訴近3天來常感頭暈前來求診。 理學檢查，血壓 172/116 mmHg，體重較兩週前增加3 kg，尿蛋白3+；超音波檢查預估胎兒體重1,900公克，有不規則子宮收縮。此時的最佳處置為：
A. 積極治療高血壓並安排門診追蹤
B. 積極進行胎兒健康評估並安排門診追蹤
C. 同時治療高血壓及進行胎兒健康評估並安排門診追蹤
D. 建議立即住院接受治療

正確答案：D. 建議立即住院接受治療